Clinical trial inclusion criterion:
Estimated life expectancy = 6 months.

Annotated entities:
- Observation: "Estimated life expectancy"
- Value: "= 6 months"